Pregnancy (ß-HCG blood-based assay)or nursing (lactating) women

The above is a clinical trial exclusion criterion. Annotated with entity spans:
[Pregnancy_considerations: Pregnancy (ß-HCG blood-based assay)or nursing (lactating) women]